Which are the uses of deep learning models in Duchenne Muscular Dystrophy?

URL_0   > Deep learning of Ultrasound imaging for evaluation of Ambulatory Function of Individuals with Duchenne Muscular Dystrophy.